age =18 and <75 years;

The above is a clinical trial inclusion criterion. Annotated with entity spans:
[Person: age] [Value: =18 and <75 years];